Clinical trial inclusion criterion:
Single or twin pregnancies

Annotated entities:
- Condition: "pregnancies"
- Value: "Single"
- Value: "twin"